Clinical trial exclusion criterion:
Hydrocephalus.

Annotated entities:
- Condition: "Hydrocephalus"